Patient with history of allergy in any kind anesthetic drug

The above is a clinical trial exclusion criterion. Annotated with entity spans:
Patient with [Temporal: history] of [Condition: allergy] in [Qualifier: any kind] [Drug: anesthetic drug]